Which cytokine molecule activates SMADs?

SMADs are activated by Transforming growth factor beta (TGF beta)